Subject has participated in any study using an investigational drug or device within 30 days or within 5 half-lives of the investigational drug (whichever is longer) of entry into this study.

The above is a clinical trial exclusion criterion. Annotated with entity spans:
Subject has [Observation: participated in any study] using an [Drug: investigational drug] or [Device: device] within 30 days or [Temporal: within 5 half-lives of the investigational drug] (whichever is longer) of entry into this study.